Clinical trial inclusion criterion:
Willingness and ability to comply with scheduled visits, treatment plans and any other study procedures

Annotated entities:
- Mood: "Willingness to comply with scheduled visits"
- Mood: "ability to comply with scheduled visits"
- Mood: "Willingness to comply with treatment plans"